preserved left ventricular ejection fraction (>= 50%) on echocardiography

The above is a clinical trial inclusion criterion. Annotated with entity spans:
[Value: preserved] [Measurement: left ventricular ejection fraction] ([Value: >= 50%]) on [Procedure: echocardiography]